Clinical trial exclusion criterion:
Pregnancy, breast feeding or plan to be pregnant woman.

Annotated entities:
- Condition: "Pregnancy"
- Observation: "breast feeding"
- Mood: "plan to be"
- Condition: "pregnant"
- Person: "woman"